Clinical trial exclusion criterion:
Currently taking systemic steroids or other immunomodulatory medications including anticancer medications and antiviral medications

Annotated entities:
- Drug: "systemic steroids"
- Procedure: "immunomodulatory medications"
- Procedure: "anticancer medications"
- Procedure: "antiviral medications"